Clinical trial exclusion criterion:
Use of oral contraceptive pills, patches, implants or hormonal intrauterine contraception in the month prior to screening

Annotated entities:
- Drug: "oral contraceptive pills"
- Device: "patches"
- Device: "implants"
- Procedure: "hormonal intrauterine contraception"
- Temporal: "in the month prior to screening"
- Reference_point: "screening"